Clinical trial inclusion criterion:
normal OGTT

Annotated entities:
- Measurement: "OGTT"
- Value: "normal"